Clinical trial exclusion criterion:
4. Increased risk of bradycardia on investigator clinical judgment

Entity relations:
- Has_qualifier("bradycardia", "Increased risk")